經本次急診抽血檢測發現患者血清HBsAg呈現陰性反應，anti-HCV呈現陽性反應，去年患者曾經接受健康檢查報告顯示當時anti-HCV為陰性反應，病史方面患者曾經於一個月前到某個私人診所接受關節軟骨生成刺激素注射治療。以下有關診斷與進一步處置規劃方面，何項是不合理的？
A. 患者可能得到急性C型肝炎
B. C型肝炎患者若出現黃疸，有較高機會自行痊癒（spontaneous recovery）
C. 急性期觀察3～4個月後，若HCV RNA持續存在，可以考慮給與抗C型肝炎病毒藥物治療
D. 藥物選擇方面，單一使用長效型干擾素（peginterferon）是沒有用的

正確答案：D. 藥物選擇方面，單一使用長效型干擾素（peginterferon）是沒有用的